40歲已婚	性，因子宮內膜息肉接受子宮鏡手術，子宮鏡使用單極電燒（monopolar）。手術時畫面清晰良好但發現電燒無法作用，經流動護士檢查電燒機功能正常，且電源接觸良好，下列何種子宮腔擴張介質（distention media）為造成無法電燒之可能原因？
A. 蒸餾水（distilled water）
B. 葡萄聚糖（dextran 70）
C. 生理食鹽水（normal saline）
D. 氨基乙酸（glycine）

正確答案：C. 生理食鹽水（normal saline）